Clinical trial exclusion criterion:
claustrophobia

Annotated entities:
- Condition: "claustrophobia"